功能性健康狀態評估中，基本的日常生活活動功能（activities of daily living，簡稱 ADL）不包括下列何項？
A. 進食
B. 如廁
C. 穿衣
D. 吃藥

正確答案：D. 吃藥